Clinical trial inclusion criterion:
Plan to remain in study area greater than 6 months

Annotated entities:
- Temporal: "greater than 6 months"
- Observation: "remain in study area"
- Mood: "Plan"